Clinical trial exclusion criterion:
Subjects on fetal hemoglobin inducing agents

Annotated entities:
- Drug: "fetal hemoglobin inducing agents"
- Qualifier: "fetal"